Patients having clinically significant abnormal laboratory, or ECG findings not resolved by further examinations.

The above is a clinical trial exclusion criterion. Annotated with entity spans:
Patients having clinically [Value: significant abnormal] [Measurement: laboratory], or [Measurement: ECG findings] [Non-query-able: not resolved by further examinations].